白色念珠菌（Candida albicans）可引起下列何種疾病？
A. 肺炎
B. 鵝口瘡
C. 紅疹
D. 咽喉炎

正確答案：B. 鵝口瘡